Which genes have been found to be associated with restless leg syndrome

Human L-Ferritin
The genotypes of five specific single-nucleotide polymorphisms (SNPs) in three genes
Homozygosity for the T-allele of BTBD9 rs9296249
MEIS1
Intragenic guanosine triphosphate cyclohydrolase-1 duplication
LRRK2 gene mutation